Clinical trial exclusion criterion:
Alcohol abuse

Annotated entities:
- Observation: "Alcohol abuse"